CRT <U+2267>250µm

The above is a clinical trial inclusion criterion. Annotated with entity spans:
[Measurement: CRT] <U+2267>[Value: 250µm]